Medical condition whose pathology or treatment would significantly increase the risk associated with the proposed protocol.

The above is a clinical trial exclusion criterion. Annotated with entity spans:
[Condition: Medical condition] whose pathology or treatment [Qualifier: would significantly increase the risk associated with the proposed protocol].